La hiponatremia forma parte del cuadro clínico de:
1. Enfermedad de Addison.
2. Diabetes insípida central.
3. Diabetes insípida nefrogénica.
4. Diabetes Mellitus.
5. Estados febriles.

Respuesta correcta: 1. Enfermedad de Addison.